2. Patients who are feasible for treatment with FOLFOX (prior adjuvant or palliative treatment is allowed)

The above is a clinical trial inclusion criterion. Annotated with entity spans:
[Parsing_Error: 2.] Patients who are [Non-query-able: feasible] for treatment with [Drug: FOLFOX] (prior [Procedure: adjuvant] or [Procedure: palliative treatment] [Non-query-able: is allowed])